Patients must have histologic proof of a malignancy suitable for radiation therapy.

The above is a clinical trial inclusion criterion. Annotated with entity spans:
Patients must have [Procedure: histologic] [Value: proof] of a [Condition: malignancy] [Qualifier: suitable for radiation therapy].